Clinical trial inclusion criterion:
Clinical diagnosis of Autism Spectrum Disorder

Annotated entities:
- Condition: "Autism Spectrum Disorder"
- Qualifier: "Clinical diagnosis"